Clinical trial exclusion criterion:
History of acute coronary syndrome in the past 30 days.

Entity relations:
- Has_temporal("acute coronary syndrome", "in the past 30 days")